Chico de 20 años, que consulta por dolor lumbosacro de ritmo inflamatorio de 4 meses de evolución. También talalgia bilateral y rigidez matutina de 1 hora. En los últimos 2 meses aparición de cuadros diarreicos con pérdida de 4 kg de peso. ¿Cuál es la aproximación diagnóstica más correcta?
1. Dada la edad del paciente, lo más probable es que padezca lumbalgia inespecífica y una tendinitis en los pies. Si persisten las diarreas realizaría estudio digestivo.
2. Realizaría estudio digestivo para descartar patología tumoral. El dolor lumbar puede ser debido a patología visceral.
3. El cuadro clínico es muy sugestivo de espondiloartritis. Habría que descartar enfermedad inflamatoria intestinal.
4. Solicitaría RNM lumbar para descartar hernia discal y si persiste diarrea, estudio digestivo.

Respuesta correcta: 3. El cuadro clínico es muy sugestivo de espondiloartritis. Habría que descartar enfermedad inflamatoria intestinal.